Clinical trial inclusion criterion:
Absence of cervical restorations extending to the CEJ

Annotated entities:
- Observation: "cervical restorations extending to the CEJ"
- Negation: "Absence"